下列何者為重症肌無力（myasthenia gravis）最常見之臨床症狀？
A. diaphragmatic weakness
B. ocular muscle weakness
C. dysphagia
D. wrist drop

正確答案：B. ocular muscle weakness